Magnetic metallic implants (such as screws, pins, shrapnel remnants, aneurysm clips, artificial heart valves, inner ear (cochlear) implants, artificial joints, and vascular stents)

The above is a clinical trial exclusion criterion. Annotated with entity spans:
[Device: Magnetic metallic implants] (such as [Device: screws], [Device: pins], [Device: shrapnel remnants], [Device: aneurysm clips], [Device: artificial heart valves], [Device: inner ear] ([Device: cochlear]) implants, [Device: artificial joints], and [Device: vascular stents])